Clinical trial exclusion criterion:
Multiple (> 1) bites

Annotated entities:
- Multiplier: "Multiple"
- Multiplier: "> 1"
- Condition: "bites"